50歲男性咳血，ㄧ週後產生急性腎衰竭，血中C-ANCA檢查陰性，肺部切片顯示肺泡壞死及出血，合併血鐵質 （hemosiderin）沉積。此病人最有可能患有下列何種肺部出血疾病？
A. 肺出血腎炎（Goodpasture）症候群
B. 原因不明肺部血鐵症（idiopathic pulmonary hemosiderosis）
C. 韋格納氏肉芽腫（Wegener granulomatosis）
D. 腎細胞癌轉移至肺部，合併出血

正確答案：A. 肺出血腎炎（Goodpasture）症候群